Clinical trial exclusion criteria:
Patient with history of allergy in any kind anesthetic drug
Patient who pregnant
Patient who sign for single port gynecologic laparoscopic surgery or NOTE surgery
Patient whom the surgery is withhold or canceled
Patient whom the surgery is converted to laparotomy

Annotated entities:
- Condition: "allergy"
- Drug: "anesthetic drug"
- Qualifier: "any kind"
- Temporal: "history"
- Condition: "pregnant"
- Qualifier: "single port"
- Procedure: "gynecologic laparoscopic surgery"
- Procedure: "NOTE surgery"
- Procedure: "surgery"
- Observation: "withhold"
- Observation: "canceled"
- Procedure: "surgery"
- Observation: "converted to"
- Procedure: "laparotomy"